Laboratory urine culture: <103 CFUs

The above is a clinical trial inclusion criterion. Annotated with entity spans:
[Measurement: Laboratory urine culture]: [Value: <103 CFUs]